What is the mechanism of action of anticoagulant medication Dabigatran?

Dabigatran is orally administered, reverisble direct and competetive inhibitor of both free and bouded thrombin.